Clinical trial exclusion criterion:
Subjects who have not been weight stable (>2 kg weight change in past 3 months)

Annotated entities:
- Negation: "not"
- Observation: "weight stable"
- Value: ">2 kg"
- Measurement: "weight change"
- Temporal: "in past 3 months"